Bilirubin < ULN.

The above is a clinical trial inclusion criterion. Annotated with entity spans:
[Measurement: Bilirubin] [Value: < ULN].